Clinical trial inclusion criterion:
Mini Mental Status (MMS) test between 16 to 26 inclusive

Annotated entities:
- Measurement: "Mini Mental Status (MMS) tes"
- Value: "between 16 to 26 inclusive"